一位 40 歲男性病患，兩個月前曾經罹患急性胰臟炎。近來主訴有上腹脹，經理學檢查發現病人有左上腹壓痛性腫脹，但無黃疸、便血或貧血的現象。病人的血清 amylase 值為 180 IU/L，lipase 值為 510 IU/L。針對本病人的下一步檢查，何項較不具有診斷性？
A. 腹部 X 光攝影
B. 腹部超音波
C. 腹部血管攝影
D. 腹部電腦斷層檢查

正確答案：C. 腹部血管攝影